Clinical trial inclusion criteria:
Type 2 diabetic inpatient
Fasting glucose >140 mg/dl or random glucose >180 mg/dl

Annotated entities:
- Condition: "Type 2 diabetic"
- Visit: "inpatient"
- Measurement: "Fasting glucose"
- Value: ">140 mg/dl"
- Measurement: "random glucose"
- Value: ">180 mg/dl"